Clinical trial inclusion criterion:
Life-expectancy > 6 months.

Annotated entities:
- Observation: "Life-expectancy"
- Value: "> 6 months"